一位47歲男性最近一個月胃口不佳、比較累且有噁心感。血液生化檢查：BUN 35 mg/dL，creatinine 1.6  mg/dL，Na+ 145 mmol/L，K+ 3.2 mmol/L，Cl- 92 mmol/L，free Ca 3.00 mmol/L。在詢問病史時，下列何者對於鑑別診斷上較無幫助？
A. 有無使用vitamin D
B. 有無嚼檳榔（含石灰佐料）習慣
C. 是否長期使用制酸劑
D. 有無使用環狀利尿劑

正確答案：D. 有無使用環狀利尿劑